如果一細胞無法合成或獲得葉酸（folic acid），則此細胞將無法合成下列那種胺基酸？
A. isoleucine
B. leucine
C. lysine
D. methionine

正確答案：D. methionine